Subjects with kidney disease (except kidney stones).

The above is a clinical trial exclusion criterion. Annotated with entity spans:
Subjects with [Condition: kidney disease] ([Negation: except] [Condition: kidney stones]).